What is the indication for Mirabegron?

mirabegron, the first β3-adrenoceptor agonist in clinical practice, is approved for treatment of overactive bladder (oab) syndrome symptoms.